Patients who have received a live vaccine within 30 days prior to the first dose of trial treatment.

The above is a clinical trial exclusion criterion. Annotated with entity spans:
Patients who have received a [Drug: live vaccine] [Temporal: within 30 days prior to the first dose of trial treatment].